Active smoking (within the past year)

The above is a clinical trial exclusion criterion. Annotated with entity spans:
[Qualifier: Active] [Observation: smoking] ([Value: within the past year])